Clinical trial exclusion criterion:
Patients with concomitant HIV infection or congenital immune deficiency diseases.

Annotated entities:
- Condition: "HIV infection"
- Qualifier: "concomitant"
- Condition: "congenital immune deficiency diseases."